Kyrgyz ethnicity

The above is a clinical trial inclusion criterion. Annotated with entity spans:
[Non-query-able: Kyrgyz ethnicity]